Clinical trial exclusion criterion:
Is known to be infected with human immunodeficiency virus (HIV) or seropositive for hepatitis C virus (HCV)

Annotated entities:
- Condition: "human immunodeficiency virus (HIV)"
- Condition: "seropositive for hepatitis C virus (HCV)"